一位 60 歲男性，因急性心肌梗塞住進心臟加護病房（CCU），經檢查並無心律不整，鬱血性心衰竭或其他併發症。其心臟復健治療於何時開始最佳？
A. 住進 CCU 之第 1 天
B. 臥床 1 週後
C. 臥床 4～6 週
D. 待病情穩定，轉至普通病房後

正確答案：A. 住進 CCU 之第 1 天